Signed written informed consent

The above is a clinical trial inclusion criterion. Annotated with entity spans:
[Informed_consent: Signed written informed consent]